Clinical trial exclusion criterion:
Hospital admission for protein losing enteropathy or plastic bronchitis within 3 months of randomization

Annotated entities:
- Procedure: "Hospital admission"
- Condition: "protein losing enteropathy"
- Condition: "plastic bronchitis"
- Temporal: "within 3 months of randomization"
- Reference_point: "randomization"